Continuous and/or progressive visual loss > 18 months or serous detachment on OCT > 18 months;

The above is a clinical trial exclusion criterion. Annotated with entity spans:
[Qualifier: Continuous] and/or [Qualifier: progressive] [Condition: visual loss] [Temporal: > 18 months] or [Condition: serous detachment] on [Procedure: OCT] [Temporal: > 18 months];